Clinical trial exclusion criterion:
Severe gastrointestinal disease, including gastroparesis. As judged by the Investigator.

Annotated entities:
- Condition: "gastrointestinal disease"
- Qualifier: "Severe"
- Condition: "gastroparesis"